Clinical trial exclusion criterion:
Enrollment time more than 1 hr since arrival to emergency room or PICU

Annotated entities:
- Observation: "Enrollment"
- Temporal: "more than 1 hr since arrival to emergency room or PICU"
- Visit: "emergency room"
- Visit: "PICU"
- Reference_point: "arrival to emergency room or PICU"